橡皮腫（Gumma）是：
A. 良性贅生性腫瘤
B. 惡性腫瘤
C. 人類乳突瘤病毒病變
D. 梅毒病變

正確答案：D. 梅毒病變